Clinical trial exclusion criterion:
During this pilot study, we will exclude non-English speaking families. However, in subsequent studies we will include the non-English speaking population.

Annotated entities:
- Observation: "non-English speaking"
- Non-representable: "However, in subsequent studies we will include the non-English speaking population."